Clinical trial exclusion criterion:
History of constipation

Annotated entities:
- Condition: "constipation"